下列有關急性胰臟炎（acute pancreatitis）的病因學（etiology）之敘述，何者錯誤？
A. 大量飲酒
B. 膽囊結石必須大於 1 公分
C. 高三酸甘油酯血症，triglyceride > 1000 mg/dL
D. 內視鏡逆行性膽胰管攝影檢查（ERCP）時，用力注射大量顯影劑入胰管

正確答案：B. 膽囊結石必須大於 1 公分